Clinical trial exclusion criterion:
Person is using under arm axillary crutches or walker.

Annotated entities:
- Device: "under arm axillary crutches"
- Device: "walker"